下列何種治療氣喘的藥物，只適合用於預防性給藥，若氣喘已發作，給與此藥則無療效？
A. albuterol
B. theophylline
C. salmeterol
D. nedocromil

正確答案：D. nedocromil